Clinical trial exclusion criteria:
submucosal leiomyoma,
endometrial hyperplasia with atypia,
history of uterine surgery

Annotated entities:
- Condition: "submucosal leiomyoma"
- Condition: "endometrial hyperplasia"
- Qualifier: "with atypia"
- Temporal: "history"
- Procedure: "uterine surgery"